Clinical trial inclusion criterion:
Willing to participate

Annotated entities:
- Competing_trial: "Willing to participate"